Clinical trial exclusion criteria:
No positive HIV 1 or HIV 2 test at screening
no history of significant skin disease such as, but not limited to rash or eruptions, drug allergies, food allergy, dermatitis, eczema, psoriasis, or urticaria
no history of allergy to drugs such as, but not limited to, sulphonamides and penicillins
no previously demonstrated clinically significant allergy or hypersensitivity to any of the excipients of the investigational medication administered in this trial
no female subject of childbearing potential without use of effective nonhormonal birth control methods, or not willing to continue practicing these birth control methods for at least 30 days after the end of the treatment period
no positive pregnancy test or breast feeding at screening

Annotated entities:
- Value: "positive"
- Measurement: "HIV 1 test"
- Measurement: "HIV 2 test"
- Temporal: "at screening"
- Reference_point: "screening"
- Condition: "skin disease"
- Temporal: "history"
- Qualifier: "significant"
- Undefined_semantics: "significant"
- Condition: "rash"
- Condition: "eruptions"
- Condition: "drug allergies"
- Condition: "food allergy"
- Condition: "dermatitis"
- Condition: "eczema"
- Condition: "psoriasis"
- Condition: "urticaria"
- Temporal: "history"
- Condition: "allergy"
- Drug: "sulphonamides"
- Drug: "penicillins"
- Temporal: "previously"
- Qualifier: "clinically significant"
- Condition: "allergy"
- Condition: "hypersensitivity"
- Drug: "excipients of the investigational medication"
- Person: "female"
- Condition: "childbearing potential"
- Negation: "without"
- Qualifier: "effective"
- Procedure: "nonhormonal birth control"
- Negation: "not"
- Mood: "willing to continue practicing"
- Procedure: "birth control methods"
- Temporal: "for at least 30 days after the end of the treatment period"
- Reference_point: "the end of the treatment period"
- Procedure: "pregnancy test"
- Value: "positive"
- Observation: "breast feeding"
- Temporal: "at screening"